有關小兒生理之敘述，何者正確？
A. 新生兒體表面積對體重比值低，所以容易失溫
B. 新生兒產熱主要是靠顫抖（shivering）
C. 心輸出量主要是依賴心率
D. 體液所占的比率比成年人低

正確答案：C. 心輸出量主要是依賴心率